List characteristics of Developmental and Epileptic Encephalopathies (DEEs).

Clinical characteristics of Developmental and Epileptic Encephalopathies include global developmental delay, contractures, refractory seizures, intractable seizures, epilepsy, facial dysmorphism, macrocephaly, cognitive deficits, autism, seizures, cerebellar dysgenesis, developmental delayed, behavioral abilities, developmental impairment or regression.